Clinical trial inclusion criterion:
Women: (0.005835 x H3) + (15 x W) + 183 = TBV [H=height in inches; W=weight in pounds]

Entity relations:
- Has_value("TBV", "(0.005835 x H3) + (15 x W) + 183")